Clinical trial inclusion criterion:
CKD patients classified as Stage 3 and 4 of National Kidney Foundation Classification with estimated glomerular filtration rate (GFR) between 15 and 59 mL/min/1.73 m2 according to the Modification of Diet in Renal Disease (MDRD) formula based on serum creatinine, age, gender, and race.

Annotated entities:
- Condition: "CKD"
- Value: "Stage 3"
- Value: "Stage 4"
- Measurement: "National Kidney Foundation Classification"
- Measurement: "estimated glomerular filtration rate (GFR)"
- Value: "between 15 and 59 mL/min/1.73 m2"
- Qualifier: "Modification of Diet in Renal Disease (MDRD) formula"